Clinical trial exclusion criterion:
Patients who previously participated in any Aliskiren study.

Entity relations:
- multi("Aliskiren study", "Aliskiren")
- Has_temporal("Aliskiren study", "previously")